Which drugs used in the treatment of Systemic Lupus Erythematosus are targeting granulocytes?

Cyclophosphamide and rituximab are used in the treatment of Systemic Lupus Erythematosus.  GLPG-0634 and INCB18424 are other drugs that target and neutralize granulocytes.